9. Asymptomatic for genital infections at the time of enrollment

The above is a clinical trial inclusion criterion. Annotated with entity spans:
9. [Mood: Asymptomatic] for [Condition: genital infections] [Temporal: at the time of enrollment]